Primary renal impairment, creatinine clearance < 45 ml/min if treated with metformin.

The above is a clinical trial exclusion criterion. Annotated with entity spans:
[Condition: Primary renal impairment], [Measurement: creatinine clearance] [Value: < 45 ml/min] if treated with [Drug: metformin].